Clinical trial exclusion criterion:
History of shoulder tumor

Entity relations:
- Has_temporal("shoulder tumor", "History of")